Major surgery in the last 3 months prior to baseline or planned major surgery or cardiac intervention during the study.

The above is a clinical trial exclusion criterion. Annotated with entity spans:
[Procedure: Major surgery] in the [Temporal: last 3 months prior to baseline or planned major surgery or cardiac intervention during the study].